Clinical trial exclusion criterion:
Being pregnant or having the intention to be pregnant before the end of the study

Annotated entities:
- Pregnancy_considerations: "Being pregnant or having the intention to be pregnant before the end of the study"